¿Cómo se denominan las proteínas implicadas en el enrollamiento y compactación del ADN?:
1. Quinasas.
2. Topoisomerasas.
3. Histonas.
4. Fosfatasas.
5. ADN nucleasas.

Respuesta correcta: 3. Histonas.